依據兒童健康手冊，關於母乳哺育兒的正常生理現象，下列何者錯誤？
A. 喝母乳的寶寶，黃疸可能持續到2～3個月才完全消退，但為避免其他疾病，如果寶寶滿月後仍有黃疸，應請教兒科醫師
B. 喝母乳的寶寶在頭幾個月的大便通常是稀稀水水的，帶有顆粒或酸味，甚至一吃就解便，一般屬於正常現象，如果身高體重異常，應請教兒科醫師
C. 有些寶寶在3週大以後，可能大便次數變少，變成3至4天才解1次軟便，甚至10到14天才解便1次
D. 喝母乳的寶寶其第一次胎便，常延遲至24至48小時才排出，屬於正常現象

正確答案：D. 喝母乳的寶寶其第一次胎便，常延遲至24至48小時才排出，屬於正常現象